Clinical trial inclusion criterion:
Enrolled in the Cystic Fibrosis Foundation National Patient Registry (CFFNPR) prior to Visit 1 (US sites only)

Entity relations:
- Has_index("prior to Visit 1", "Visit 1")
- Has_temporal("Enrolled in the Cystic Fibrosis Foundation National Patient Registry (CFFNPR)", "prior to Visit 1")
- Has_context("US sites", "Enrolled in the Cystic Fibrosis Foundation National Patient Registry (CFFNPR)")